Clinical trial inclusion criterion:
ECOG performance status of 0,1, or 2.

Entity relations:
- Has_value("ECOG performance status", "0")
- OR("0", "0,1", ".")